Clinically significant liver disease.

The above is a clinical trial exclusion criterion. Annotated with entity spans:
[Qualifier: Clinically significant] [Condition: liver disease].